Clinical trial exclusion criterion:
pericardial effusion greater than 10 mm;

Annotated entities:
- Condition: "pericardial effusion"
- Qualifier: "greater than 10 mm"